Clinical trial exclusion criterion:
Substance abuse, such as alcohol (>80 g/day), I.V. drugs and inhaled drugs in the past 2 years.

Annotated entities:
- Condition: "Substance abuse"
- Qualifier: "alcohol"
- Qualifier: "I.V. drugs"
- Qualifier: "inhaled drugs"
- Temporal: "in the past 2 years."
- Multiplier: ">80 g/day"